Clinical trial inclusion criterion:
between 16-25 years of age

Annotated entities:
- Value: "16-25 years"
- Person: "age"